Presence of at least 2 cryopreserved good quality cleavage-stage embryo (good quality cleavage-stage embryos display stage-specific cell division, have blastomeres of fairly equal size with few to no cytoplasmic fragments).

The above is a clinical trial inclusion criterion. Annotated with entity spans:
Presence of [Multiplier: at least 2] [Qualifier: cryopreserved] [Qualifier: good] quality [Observation: cleavage-stage embryo] (good quality cleavage-stage embryos display stage-specific cell division, have blastomeres of fairly equal size with few to no cytoplasmic fragments).